Clinical trial exclusion criterion:
Hypertensive (>160/100 mmHg)

Annotated entities:
- Condition: "Hypertensive"
- Value: ">160/100 mmHg"
- Measurement: "Hypertensive"